11. History of learning disability or current ADHD

The above is a clinical trial exclusion criterion. Annotated with entity spans:
[Parsing_Error: 11.] [Temporal: History] of [Condition: learning disability] or [Temporal: current] [Condition: ADHD]